下列何種藥物用於治療慢性酒精中毒？
A. Dobutamine
B. Carbidopa
C. Reserpine
D. Disulfiram

正確答案：D. Disulfiram